Clinical trial inclusion criterion:
a follow-up at least 12 months

Entity relations:
- Has_temporal("follow-up", "at least 12 months")